下列具細胞週期專一性之抗癌藥物（cell cycle-specific agents）中，藥物與其所抑制細胞週期之配對，何者正 確？
A. capecitabine－mitosis（M）期
B. irinotecan－DNA synthesis（S）期
C. ixabepilone－M期
D. vincristine－S期

正確答案：C. ixabepilone－M期